Contraindication to beta-blocker

The above is a clinical trial exclusion criterion. Annotated with entity spans:
[Condition: Contraindication] to [Drug: beta-blocker]